Stenosis of more than 50% in femoropopliteal artery

The above is a clinical trial inclusion criterion. Annotated with entity spans:
[Condition: Stenosis] of [Value: more than 50%] in [Qualifier: femoropopliteal artery]